Must have a life expectancy of greater than three (3) months

The above is a clinical trial inclusion criterion. Annotated with entity spans:
Must have a [Observation: life expectancy] of [Value: greater than three (3) months]